What is the function of PARP1?

PARP1 is an abundant nuclear protein with many pleiotropic functions involved in epigenetic and transcriptional controls.  PARP1 plays key roles in DNA repair, as well as a wide variety of cellular processes, including transcriptional regulation, chromatin modulation, cellular signaling pathway, inflammation, cellular stress responses and so on.